1. Use of any medication within the 14 days prior to the initial dose of study medication.

The above is a clinical trial exclusion criterion. Annotated with entity spans:
[Parsing_Error: 1.] Use of any [Drug: medication] [Temporal: within the 14 days prior] to [Reference_point: the initial dose of study medication].